Las fibras sensoriales con mayor velocidad de conducción son de:
1. Propiocepción.
2. Tacto discriminativo.
3. Temperatura.
4. Dolor.

Respuesta correcta: 1. Propiocepción.